Clinical trial exclusion criterion:
Patients who has acute cholecystitis,pancreatitis,pancreaticobiliary diseases, especially choledocholithiasis.

Annotated entities:
- Condition: "acute cholecystitis"
- Condition: "pancreatitis"
- Condition: "pancreaticobiliary diseases"
- Condition: "choledocholithiasis"